Clinical trial exclusion criterion:
Progressive neurological or neuromuscular disorders having a major impact on exercise capacity

Entity relations:
- AND("neuromuscular disorders Progressive", "impact on exercise capacity")
- OR("neuromuscular disorders Progressive", "disorders Progressive neurological")